Clinical trial exclusion criterion:
Presence of significant cardiac disease (history of unstable ischemic heart disease, heart failure, severe and uncontrolled hypertension) that, in the opinion of the investigator, would put the patient at risk of a clinically significant arrhythmia or myocardial infarction

Entity relations:
- Has_qualifier("cardiac disease", "significant")
- Has_qualifier("hypertension", "uncontrolled")
- Has_qualifier("hypertension", "severe")
- Has_temporal("unstable ischemic heart disease", "history")
- Has_qualifier("arrhythmia", "clinically significant")
- Has_mood("arrhythmia", "at risk of")
- Subsumes("cardiac disease", "unstable ischemic heart disease")
- OR("unstable ischemic heart disease", "heart failure", "hypertension")
- OR("arrhythmia", "myocardial infarction")